Clinical trial exclusion criterion:
Pregnancy related conditions.

Annotated entities:
- Condition: "Pregnancy"
- Condition: "conditions"
- Qualifier: "Pregnancy related"